下列喉部構造何者淋巴供應（lymphatic supply）最少？
A. 假聲帶（false cord）
B. 真聲帶（true cord）
C. 聲門上區（supraglottis）
D. 聲門下區（subglottis）

正確答案：B. 真聲帶（true cord）